Clinical trial inclusion criterion:
Informed consent form has been signed and dated by the parent(s) or other legally acceptable representative(s) (if applicable)

Annotated entities:
- Non-query-able: "Informed consent form has been signed and dated by the parent(s) or other legally acceptable representative(s) (if applicable)"